Which is the main epigenetic difference between poised and constitutive enhancers?

We find that histone H3K27ac distinguishes active enhancers from inactive/poised enhancer elements containing H3K4me1 alone.